我國近年的自殺死亡率是：
A. 每千人口 12~14 人
B. 每萬人口 12~14 人
C. 每十萬人口 12~14 人
D. 每百萬人口 12~14 人

正確答案：C. 每十萬人口 12~14 人